Clinical trial inclusion criterion:
Women with recently diagnosed breast cancer and who will receive NAC to reduce tumor burden before surgery. (including locally advanced breast cancer (LABC) according to clinical assessment; or tumor size > 2cm, that is, at least T2 in TNM staging).

Entity relations:
- Has_index("before surgery", "surgery")
- Has_qualifier("NAC", "reduce tumor burden")
- AND("breast cancer", "NAC")
- Has_temporal("NAC", "before surgery")